Clinical trial exclusion criterion:
Blood donation of more than 450ml in the previous three months.

Entity relations:
- Has_value("of more than 450ml", "more than 450ml")
- Has_qualifier("Blood donation", "of more than 450ml")
- Has_temporal("Blood donation", "in the previous three months")